Clinical trial exclusion criterion:
Hemosiderosis/hemochromatosis ( patients can still be included in the non-ferumoxytol arm)

Annotated entities:
- Condition: "Hemosiderosis"
- Condition: "hemochromatosis"